Clinical trial exclusion criterion:
Individuals with scalp shrapnel, cochlear implants, or aneurysm clips.

Entity relations:
- OR("scalp shrapnel", "cochlear implants", "aneurysm clips")